severe atrioventricular block (2nd and 3rd degree)

The above is a clinical trial exclusion criterion. Annotated with entity spans:
[Qualifier: severe] [Condition: atrioventricular block] ([Qualifier: 2nd] and [Qualifier: 3rd degree])